Clinical trial inclusion criterion:
at least two symptoms of UTI (dysuria, urgency of micturition, frequency, lower abdominal pain)

Entity relations:
- Has_multiplier("symptoms of UTI", "at least two")
- Subsumes("symptoms of UTI", "dysuria")
- OR("dysuria", "urgency of micturition", "frequency", "lower abdominal pain")